Patient is participating in an investigational drug or device clinical trial that has not reached its primary endpoint

The above is a clinical trial inclusion criterion. Annotated with entity spans:
[Non-query-able: Patient is participating in an investigational drug or device clinical trial that has not reached its primary endpoint]